Clinical trial inclusion criterion:
Currently receiving treatment with an atypical antipsychotic and continuation on the medication has been recommended

Entity relations:
- AND("treatment", "atypical antipsychotic")
- Has_temporal("treatment", "Currently")
- Has_mood("continuation on the medication", "recommended")
- AND("continuation on the medication", "atypical antipsychotic")